有關試管嬰兒療程中，胚胎培養與植入的敘述，下列何者錯誤？
A. 胚胎培養的初期（pre-compaction），建議培養基需要較多的丙酮酸（pyruvate）來模擬輸卵管的環境
B. 胚胎培養的後期（post-compaction），建議培養基需要較多非必需胺基酸（non-essential amino acids）來
C. 當患者條件正常時，囊胚期胚胎植入相較於分裂中的胚胎植入有較高的	床率
D. 胚胎培養至囊胚期相較於分裂中的胚胎，有較高的機會沒有胚胎可以植入

正確答案：B. 胚胎培養的後期（post-compaction），建議培養基需要較多非必需胺基酸（non-essential amino acids）來